3. Patients have been diagnosed with cancer of the liver

The above is a clinical trial exclusion criterion. Annotated with entity spans:
3. Patients have been diagnosed with [Condition: cancer of the liver]